Clinical trial inclusion criterion:
aged between 3 - 36 months

Annotated entities:
- Person: "aged"
- Value: "between 3 - 36 months"